一位 56 歲男性病人血壓 80/40 mmHg（平均 54 mmHg），Swan-Ganz 順流導管結果顯示 PAP：32/21 mmHg （平均 26 mmHg）、PAWP：17 mmHg、CVP：13 mmHg、cardiac output：6.7 L/min，體表面積：2 m2，則此病人休克最可能的原因為何？
A. 心因性休克
B. 敗血性休克
C. hypovolemic 休克
D. 神經性休克

正確答案：B. 敗血性休克